Clinical trial exclusion criterion:
indications to anticoagulation at the time of enrollment or predicted appearance of such indications within the duration of the trial (eg. pulmonary embolism)

Entity relations:
- Subsumes("predicted appearance", "pulmonary embolism")
- AND("indications", "anticoagulation")
- Has_temporal("indications", "at the time of enrollment")
- Subsumes("within the duration of the trial", "pulmonary embolism")
- OR("at the time of enrollment", "predicted appearance")